小芬 20 歲，因車禍嚴重顱內出血，住進加護病房靠呼吸器維生已有五天，現在經法定程序判定腦死，其父母親已簽具同意書表達捐贈器官的意願，醫院也找到合法的受贈者，你現在可以採取何種處置？
A. 等待心跳停止才進行器官移植作業
B. 可以進行後續器官移植作業
C. 由捐贈家屬向受贈家屬表達捐贈之意
D. 需要小芬本人生前的器官捐贈意願證據才能進行移植作業

正確答案：B. 可以進行後續器官移植作業